Clinical trial inclusion criteria:
Patients with either Relapsing-remitting MS (RRMS), Secondary progressive MS (SPMS), or Primary progressive MS (PPMS) by McDonald 2010 criteria.
Patients defined by subtype based on 2013 updated phenotypic criteria.
prospectively with an EDSS change of at least 1.0 points over the last two years, or
retrospectively, with any significant change in motor function over at least one year, unrelated to relapse.
55 years of age or older at time of randomization;
No evidence of recent new inflammatory disease activity (inactive by the Lublin criteria16) with no new relapse for at least five years and no new MRI lesion for at least three years
interferon ß-1a,
interferon ß-1b,
glatiramer acetate,
natalizumab,
fingolimod,
dimethyl fumarate, or
teriflunomide; continuously for no less than 5 years.
Taking most recent DMT continuously* for no less than two years.
Willing to be randomized per this protocol; each patient will be questioned as to their willingness to stay in the trial regardless of the group to which group they are randomized.
Willing to follow the protocol
Continuously will be defined as no less than 75% of all prescribed doses, with no time of greater than four weeks from last intended dose to have missed a dose (8 weeks for natalizumab, i.e. one missed dose).

Annotated entities:
- Condition: "Relapsing-remitting MS (RRMS)"
- Condition: "Secondary progressive MS (SPMS)"
- Condition: "Primary progressive MS (PPMS)"
- Non-representable: "Patients defined by subtype based on 2013 updated phenotypic criteria."
- Condition: "EDSS change"
- Value: "at least 1.0 points"
- Temporal: "over the last two years"
- Qualifier: "significant"
- Condition: "change in motor function"
- Temporal: "over at least one year"
- Qualifier: "unrelated to relapse"
- Value: "55 years or older"
- Person: "age"
- Temporal: "at time of randomization"
- Condition: "inflammatory disease"
- Measurement: "Lublin criteria"
- Value: "inactive"
- Qualifier: "new"
- Negation: "No"
- Condition: "relapse"
- Qualifier: "new"
- Negation: "no"
- Temporal: "for at least five years"
- Condition: "lesion"
- Procedure: "MRI"
- Temporal: "for at least three years"
- Negation: "no"
- Qualifier: "new"
- Drug: "interferon ß-1a"
- Drug: "interferon ß-1b"
- Drug: "glatiramer acetate"
- Drug: "natalizumab"
- Drug: "fingolimod"
- Drug: "dimethyl fumarate"
- Drug: "teriflunomide"
- Temporal: "for no less than 5 years"
- Multiplier: "continuously"
- Drug: "DMT"
- Multiplier: "continuously"
- Temporal: "for no less than two years"
- Post-eligibility: "Willing to be randomized per this protocol; each patient will be questioned as to their willingness to stay in the trial regardless of the group to which group they are randomized."
- Post-eligibility: "Willing to follow the protocol"
- Non-representable: "Continuously will be defined as no less than 75% of all prescribed doses, with no time of greater than four weeks from last intended dose to have missed a dose (8 weeks for natalizumab, i.e. one missed dose)."